Major surgery, biopsy of a parenchymal organ, or significant trauma within the past 2 months (this includes any trauma associated with the current myocardial infarction)

The above is a clinical trial exclusion criterion. Annotated with entity spans:
[Procedure: Major surgery], [Procedure: biopsy] of a [Qualifier: parenchymal organ], or [Qualifier: significant] [Condition: trauma] within the [Temporal: past 2 months] (this includes any trauma associated with the current [Condition: myocardial infarction])